對於燒燙傷病人，上肢輔具固定手腕、掌、指的原則，下列敘述何者錯誤？
A. 腕關節略呈伸展（slight extension）姿勢
B. 指間關節（interphalangeal joint）置於伸展姿勢
C. 掌指關節（metacarpophalangeal joint）置於彎曲（flexion）姿勢
D. 大拇指置於掌外展（palmar abduction）與彎曲姿勢

正確答案：D. 大拇指置於掌外展（palmar abduction）與彎曲姿勢